Clinical trial inclusion criteria:
Patients eligible for PCI with application of DES, due to ACS.
Patients with known or newly diagnosed T2D (type 2 diabetes is diagnosed according to current WHO criteria or by the use of anti-diabetic drugs)
Male and female subjects 18-80 years.
HbA1c (accordingly to IFCC) 47 mmol/mol - 110 mmol/mol.
Signed informed consent form.

Annotated entities:
- Procedure: "PCI"
- Procedure: "DES"
- Condition: "ACS"
- Condition: "T2D"
- Person: "Male"
- Person: "female"
- Person: "years"
- Value: "18-80"
- Measurement: "HbA1c"
- Value: "47 mmol/mol - 110 mmol/mol"
- Informed_consent: "Signed informed consent form"